Clinical trial inclusion criterion:
In good general health, without significant medical history, physical examination findings, or clinical laboratory abnormalities.

Annotated entities:
- Condition: "good general health"
- Undefined_semantics: "In good general health, without significant medical history, physical examination findings, or clinical laboratory abnormalities."
- Context_Error: "In good general health, without significant medical history, physical examination findings, or clinical laboratory abnormalities."
- Subjective_judgement: "In good general health, without significant medical history, physical examination findings, or clinical laboratory abnormalities."